下列對前鋸肌（serratus anterior）的敘述，何者正確？
A. 在胸廓的前壁
B. 下壓肋骨
C. 由肋間神經支配
D. 可向前旋轉肩胛骨

正確答案：D. 可向前旋轉肩胛骨